Living in the area throughout the duration of the study

The above is a clinical trial inclusion criterion. Annotated with entity spans:
[Observation: Living in the area] [Temporal: throughout the duration of the study]